下列肝硬化合併腹水之處理原則，何者錯誤？
A. 平躺休息
B. 使用 aldosterone inhibitors
C. 使用 loop diuretics
D. 使用預防性抗生素以防感染

正確答案：D. 使用預防性抗生素以防感染